Clinical trial exclusion criterion:
History of blood clotting or bleeding abnormalities

Entity relations:
- OR("blood clotting abnormalities", "bleeding abnormalities")